¿Qué aspecto/s caracteriza/n la evaluación de los problemas infantiles en comparación con la evaluación de adultos?
1. Emplear técnicas e instrumentos con garantías psicométricas de fiabilidad y validez.
2. Utilizar especialmente observación, enfatizar las conductas manifiestas y subrayar los determinantes externos de las mismas.
3. Posibilitar la planificación del tratamiento posterior.
4. Asegurar la confidencialidad de la información obtenida.
5. Efectuar la evaluación a través de la aplicación de distintas técnicas e instrumentos.

Respuesta correcta: 2. Utilizar especialmente observación, enfatizar las conductas manifiestas y subrayar los determinantes externos de las mismas.